Clinical trial inclusion criterion:
Patients with either Relapsing-remitting MS (RRMS), Secondary progressive MS (SPMS), or Primary progressive MS (PPMS) by McDonald 2010 criteria.

Annotated entities:
- Condition: "Relapsing-remitting MS (RRMS)"
- Condition: "Secondary progressive MS (SPMS)"
- Condition: "Primary progressive MS (PPMS)"